下列何種檢查最能鑑定分辨乳房硬塊的囊腔性（Cystic）或實質性（Solid）？
A. 乳房 X 光攝影（Mammography）
B. 乳房溫度攝影（Thermography）
C. 乳房超音波（Ultrasound）
D. 乳房觸診（Palpation）

正確答案：C. 乳房超音波（Ultrasound）